Male or female = 18 years of age at Visit 1.

The above is a clinical trial inclusion criterion. Annotated with entity spans:
[Person: Male] or [Person: female] [Value: = 18 years] of [Person: age] [Temporal: at Visit 1.]